Clinical trial inclusion criterion:
Treatment naïve, i.e., no previous anti-VEGF treatment in the study eye or no anti-VEGF treatment in the 45 days prior to study enrollment.

Annotated entities:
- Observation: "Treatment naïve"
- Negation: "no"
- Temporal: "previous"
- Procedure: "anti-VEGF treatment"
- Qualifier: "in the study eye"
- Negation: "no"
- Procedure: "anti-VEGF treatment"
- Temporal: "in the 45 days prior to study enrollment"
- Reference_point: "study enrollment"